Clinical trial inclusion criterion:
18 years of age or older

Entity relations:
- Has_value("age", "18 years of or older")